Clinical trial exclusion criterion:
Fetus with IUGR

Annotated entities:
- Condition: "IUGR"
- Condition: "Fetus"